Clinical trial exclusion criterion:
Metastatic tumor

Annotated entities:
- Condition: "tumor"
- Qualifier: "Metastatic"